¿Qué enzima utiliza FAD como coenzima?
1. Isocitrato deshidrogenasa.
2. Glucosa 6-fosfato deshidrogenasa.
3. Succinato deshidrogenasa.
4. Malato deshidrogenasa.
5. Lactato deshidrogenasa.

Respuesta correcta: 3. Succinato deshidrogenasa.